Clinical trial inclusion criterion:
4. The subject has manifested at least 1 of the following symptoms while standing or had a medical history of 1 of the following when not treated for orthostatic hypotension (OH): dizziness, lightheadedness, feeling faint, or feeling like they might black out.

Entity relations:
- AND("treated", "orthostatic hypotension (OH)")
- Has_negation("treated", "not")
- Has_multiplier("dizziness", "1")
- AND("treated", "dizziness")
- Has_multiplier("lightheadedness", "1")
- Has_multiplier("feeling faint", "1")
- Has_multiplier("feeling like they might black out", "1")
- AND("treated", "lightheadedness")
- AND("treated", "feeling faint")
- AND("treated", "feeling like they might black out")